Which retinal dystrophy related gene is targeted by the AAV2-hRPE65v2 drug?

AAV2-hRPE65v2, also called voretigene neparvovec, targets the RPE65 gene, whose mutations lead to retinal dystrophy.